Negative for HBsAg and for antibodies to HCV, HIV-1.

The above is a clinical trial inclusion criterion. Annotated with entity spans:
[Value: Negative] for [Measurement: HBsAg] and for [Measurement: antibodies to HCV], [Measurement: HIV-1].